下列何種寄生蟲感染會導致皮膚幼蟲移行症（cutaneous larva migrans）？
A. 犬心絲蟲（Dirofilaria immitis）
B. 犬鉤蟲（Ancylostoma caninum）
C. 犬蛔蟲（Toxocara canis）
D. 肝毛細線蟲（Capillaria hepatica）

正確答案：B. 犬鉤蟲（Ancylostoma caninum）